Clinical trial exclusion criterion:
History of penetrating keratoplasty.

Annotated entities:
- Procedure: "penetrating keratoplasty"
- Temporal: "History"